Clinical trial exclusion criterion:
Total cholesterol =300 mg/dL

Entity relations:
- Has_value("Total cholesterol", "=300 mg/dL")